Other neoplastic disease in the 5 previous years, except squamous or basal cell skin carcinoma or cervical "in situ" carcinoma

The above is a clinical trial exclusion criterion. Annotated with entity spans:
[Qualifier: Other] [Condition: neoplastic disease] [Temporal: in the 5 previous years], [Negation: except] [Condition: squamous] or [Condition: basal cell skin carcinoma] or [Condition: cervical "in situ" carcinoma]